若蛋白質A的正確摺疊（folding）需要另一蛋白質B的幫助，然而蛋白質B的正確摺疊不需要蛋白質A的幫忙。蛋白質B是屬於下列何種物質？
A. 配體（ligand）
B. 分子伴護子（molecular chaperone）
C. 蛋白質A的同功酶（isoenzyme）
D. 結構基序（structural motif）

正確答案：B. 分子伴護子（molecular chaperone）